Born prior to 34 weeks

The above is a clinical trial exclusion criterion. Annotated with entity spans:
[Person: Born] [Value: prior to 34 weeks]